Clinical trial inclusion criterion:
All subjects will have normal cognition at baseline: a Clinical Dementia Rating CDR=0, Global Deterioration Scale GDS<2.

Entity relations:
- Has_temporal("normal cognition", "at baseline")
- Has_value("Clinical Dementia Rating CDR", "=0")
- Has_value("Global Deterioration Scale GDS", "<2")
- AND("normal cognition", "Clinical Dementia Rating CDR")
- AND("normal cognition", "Global Deterioration Scale GDS")